Clinical trial exclusion criterion:
Pregnant or lactating females.

Annotated entities:
- Condition: "Pregnant"
- Condition: "lactating"
- Person: "females"
- Pregnancy_considerations: "Pregnant or lactating females."